Clinical trial exclusion criterion:
current participation in any other clinical trial or participation in another clinical trial within 30 days before screening

Annotated entities:
- Competing_trial: "current participation in any other clinical trial or participation in another clinical trial within 30 days before screening"